Clinical trial exclusion criterion:
8. Known allergy to mushrooms or related food products.

Entity relations:
- OR("allergy to mushrooms", "allergy to food products")